Pregnancy (urine pregnancy tests on the day of scans for menstruating girls).

The above is a clinical trial exclusion criterion. Annotated with entity spans:
[Condition: Pregnancy] ([Procedure: urine pregnancy tests] [Temporal: on the day of scans] for [Person: menstruating girls]).